Subject has other medical or surgical conditions which would preclude the potential benefit of surgery, such as congenital abnormalities, immunosuppressive disease, elevation of sedimentation rate unexplained by other diseases, elevation of white blood count (WBC), or marked left shift in the WBC differential count.

The above is a clinical trial inclusion criterion. Annotated with entity spans:
Subject has other [Condition: medical] or [Condition: surgical conditions] which would [Negation: preclude] the potential benefit of [Procedure: surgery], such as [Condition: congenital abnormalities], [Condition: immunosuppressive disease], [Value: elevation] of [Measurement: sedimentation rate] [Qualifier: unexplained by other diseases], [Value: elevation] of [Measurement: white blood count (WBC)], or marked [Value: left shift] in the [Measurement: WBC differential count].